Clinical trial inclusion criterion:
ejection fraction < 40 % as assessed by 2D echocardiography

Annotated entities:
- Measurement: "ejection fraction"
- Value: "< 40 %"
- Procedure: "2D echocardiography"